Clinical trial exclusion criterion:
Newborn infants <28 weeks and >34 weeks gestation, those with life threatening illness, congenital and chromosomal anomalies, gastrointestinal anomalies or necrotizing enterocolitis and fed premature formula

Entity relations:
- Has_value("gestation", "<28 weeks and >34 weeks")
- OR("life threatening illness", "chromosomal anomalies", "gastrointestinal anomalies", "necrotizing enterocolitis", "anomalies congenital")